下列何種疾病不是基因之三核苷酸重覆（trinucleotide repeat）過多所導致？
A. DiGeorge 症候群
B. Friedreich ataxia
C. Huntington chorea
D. fragile X 症候群

正確答案：A. DiGeorge 症候群